17. Subject with life expectancy less than 6 months as assessed by investigators;

The above is a clinical trial exclusion criterion. Annotated with entity spans:
17. Subject with [Observation: life expectancy] [Value: less than 6 months] as assessed by investigators;